2006 年台灣子宮頸癌全年發生率（incidence），分子是 2006 年台灣新發生之子宮頸癌個案數，則其分母是：
A. 2006 年台灣全人口數
B. 2006 年台灣全部女性人口數
C. 2006 年台灣全部女性罹患癌症的個案數
D. 2006 年台灣女性有機會得到子宮頸癌，但尚未罹患的人口數

正確答案：D. 2006 年台灣女性有機會得到子宮頸癌，但尚未罹患的人口數